¿Dentro de qué diagnóstico, del DSM-IV-TR, se encuadra el trastorno disfórico premenstrual?
1. Como un trastorno mixto de ansiedad y depresión.
2. Como un trastorno depresivo no especificado.
3. Como un trastorno distímico.
4. Como un trastorno ciclotímico.
5. Trastorno de ansiedad no especificado.

Respuesta correcta: 2. Como un trastorno depresivo no especificado.